Vein diameter < 3mm

The above is a clinical trial exclusion criterion. Annotated with entity spans:
[Measurement: Vein diameter] [Value: < 3mm]